Clinical trial inclusion criterion:
Male or female outpatients aged at least 18 years and not more than 45 years.

Annotated entities:
- Person: "Male"
- Person: "female"
- Visit: "outpatients"
- Value: "at least 18 years and not more than 45 years"
- Person: "aged"